Clinical trial inclusion criterion:
Functional class II, III or IV by the New York Heart Association (NYHA)

Annotated entities:
- Measurement: "New York Heart Association (NYHA)"
- Value: "Functional class II, III or IV"